Clinical trial inclusion criterion:
= 3 UTIs within the last 12 months or = 2 UTIs within the last 6 months;

Annotated entities:
- Condition: "UTIs"
- Multiplier: "= 3"
- Temporal: "within the last 12 months"
- Multiplier: "= 2"
- Condition: "UTIs"
- Temporal: "within the last 6 months"